Upper GIB secondary to bleeding esophageal varices as show by esophageal endoscopy, requiring endoscopic band ligation (EBL) at presentation

The above is a clinical trial inclusion criterion. Annotated with entity spans:
[Condition: Upper GIB] [Qualifier: secondary] to [Qualifier: bleeding] [Condition: esophageal varices] as show by [Procedure: esophageal endoscopy], [Mood: requiring] [Procedure: endoscopic band ligation (EBL)] [Temporal: at presentation]